Clinical trial exclusion criterion:
Previously documented evidence of Pure Red Cell Aplasia (PRCA)

Entity relations:
- Subsumes("Pure Red Cell Aplasia", "PRCA")